chronic cholecystitis

The above is a clinical trial exclusion criterion. Annotated with entity spans:
[Condition: chronic cholecystitis]